Active hepatobiliary disease

The above is a clinical trial exclusion criterion. Annotated with entity spans:
[Qualifier: Active] [Condition: hepatobiliary disease]